What is Behçet's disease

Behet's disease (BD) is a complex chronic relapsing inflammatory disorder of unknown etiology.